Clinical trial exclusion criterion:
2. Has not had a GTC seizure within the last year AND is not expected to have a reduction of anti-epileptic drugs during their hospital admission.

Entity relations:
- Has_temporal("GTC seizure", "within the last year")
- Has_negation("GTC seizure", "not")
- AND("reduction of anti-epileptic drugs", "anti-epileptic drugs")
- Has_index("during their hospital admission", "hospital admission")
- Has_temporal("reduction of anti-epileptic drugs", "during their hospital admission")
- Has_negation("reduction of anti-epileptic drugs", "not")